Moderate to severe pain (NVS>4).

The above is a clinical trial inclusion criterion. Annotated with entity spans:
[Qualifier: Moderate] to [Qualifier: severe] [Condition: pain] ([Measurement: NVS][Value: >4)].